Clinical trial exclusion criterion:
Serum creatinine > twice the upper limit of the normal range

Annotated entities:
- Measurement: "Serum creatinine"
- Value: "> twice the upper limit of the normal range"